Clinical trial exclusion criterion:
The participant has a Mini-Mental State Examinations (MMSE) score of <= 24. psychiatric disease.

Entity relations:
- Has_value("Mini-Mental State Examinations (MMSE)", "<= 24")